Thrombocytopenia < 50 x 10 gigalitres (Gl)

The above is a clinical trial exclusion criterion. Annotated with entity spans:
[Measurement: Thrombocytopenia] [Value: < 50 x 10 gigalitres (Gl)]